Clinical trial exclusion criterion:
History or other evidence of bleeding from esophageal varices or other conditions consistent with decompensated liver disease.

Entity relations:
- AND("bleeding", "esophageal varices")
- Has_qualifier("conditions consistent with decompensated liver disease", "other")
- OR("bleeding", "conditions consistent with decompensated liver disease")